Clinical trial inclusion criteria:
Participants having H. pylori related chronic gastritis with/without peptic ulcers who are aged greater than 20 years old and are willing to received eradication therapy.

Annotated entities:
- Qualifier: "H. pylori related"
- Condition: "chronic gastritis"
- Condition: "peptic ulcers"
- Person: "aged"
- Value: "greater than 20 years old"
- Procedure: "eradication therapy"
- Mood: "willing to receive"